7. Significant stenosis has been defined as a stenosis of more than 50% in luminal diameter (in at least one view, on visual interpretation or preferably by QCA);

The above is a clinical trial inclusion criterion. Annotated with entity spans:
7. [Condition: Significant stenosis] has been defined as a [Measurement: stenosis] of [Value: more than 50% in luminal diameter] (in at least one view, on visual interpretation or preferably by QCA);